傳導疼痛訊息的神經系統（nociceptive pathways）是以下列何種纖維傳導？
A. C-fiber + A-beta fiber
B. C-fiber + A-delta fiber
C. C-fiber + A-gamma fiber
D. A-beta fiber + A-delta fiber

正確答案：B. C-fiber + A-delta fiber